Clinical trial exclusion criterion:
not diabetic patient;

Annotated entities:
- Condition: "diabetic"
- Negation: "not"